Subject is 65 years old who is able and willing to give an informed consent.

The above is a clinical trial inclusion criterion. Annotated with entity spans:
Subject is [Value: 65 years] [Person: old] who is [Informed_consent: able and willing to give an informed consent].